Clinical trial inclusion criterion:
Sexually active (i.e. =1 attempt/week) males, 40 - 64 years of age (inclusive) at time of screening

Entity relations:
- Has_value("age", "40 - 64 years")
- Has_multiplier("Sexually active", "=1 attempt/week")